Current punctal plugging

The above is a clinical trial exclusion criterion. Annotated with entity spans:
[Temporal: Current] [Condition: punctal plugging]